Clinical trial inclusion criterion:
preserved left ventricular ejection fraction (>= 50%) on echocardiography

Entity relations:
- Subsumes("preserved", ">= 50%")
- Has_value("left ventricular ejection fraction", "preserved")
- AND("echocardiography", "left ventricular ejection fraction")